Clinical trial exclusion criteria:
Known intolerance to the doxycycline Body weight <40 kg Pregnancy or breastfeeding History of severe allergic reaction or anaphylaxis Alcohol or drug abuse

Annotated entities:
- Condition: "intolerance to the doxycycline"
- Drug: "doxycycline"
- Measurement: "Body weight"
- Value: "<40 kg"
- Condition: "Pregnancy"
- Observation: "breastfeeding"
- Condition: "allergic reaction"
- Qualifier: "severe"
- Condition: "anaphylaxis"
- Condition: "Alcohol abuse"
- Condition: "drug abuse"
- Temporal: "History of"